Subjects undergoing burn excision surgery for standard of care purposes

The above is a clinical trial inclusion criterion. Annotated with entity spans:
Subjects [Temporal: undergoing] [Procedure: burn excision surgery] for standard of care purposes